Do not sign informed consent

The above is a clinical trial exclusion criterion. Annotated with entity spans:
[Observation: Do not sign informed consent]